下列何種降血壓藥物，在⻑期服用高劑量治療時，若立即停藥會因為強烈增加交感神經活性，可能引發致命性高血壓？
A. clonidine
B. nifedipine
C. hydralazine
D. captopril

正確答案：A. clonidine